Clinical trial exclusion criterion:
Treatment site has active skin lesion or inflammation

Annotated entities:
- Condition: "skin lesion"
- Condition: "inflammation"
- Qualifier: "active"